HIV-infected at screening or enrollment

The above is a clinical trial exclusion criterion. Annotated with entity spans:
[Condition: HIV-infected] [Temporal: at screening] or enrollment